El espectro de Discroísmo Circular de una molécula da información sobre:
1. El punto isosbéstico.
2. El punto isoeléctrico.
3. Cromóforos ópticamente activos.
4. Grupos funcionales.
5. Peso molecular.

Respuesta correcta: 3. Cromóforos ópticamente activos.